Single stroke having occurred more than 6 months before (previous TIA is accepted).

The above is a clinical trial inclusion criterion. Annotated with entity spans:
[Multiplier: Single] [Condition: stroke] having occurred [Temporal: more than 6 months] before (previous [Condition: TIA] is accepted).